What is miravirsen?

Miravirsen is an AntimiR-122 for hepatitis C virus infection. Miravirsen, a locked-nucleic acid oligonucleotide, sequesters miR-122 and inhibits HCV replication.